Clinical trial exclusion criterion:
Administration of other antiarrhythmics for acute heart rate control (excluding adenosine)

Entity relations:
- Has_qualifier("heart rate control", "acute")
- AND("antiarrhythmics", "heart rate control")
- Has_negation("adenosine", "excluding")
- AND("antiarrhythmics", "adenosine")